Clinical trial inclusion criterion:
Aged between 18 and 40 years

Entity relations:
- Has_value("Aged", "between 18 and 40 years")